Clinical trial inclusion criterion:
Must be currently smoking at least ½ pack/day at baseline (confirmed with cotinine level and CO Smokerlyzer

Annotated entities:
- Observation: "smoking"
- Value: "at least ½"
- Measurement: "pack/day"
- Temporal: "at baseline"
- Procedure: "cotinine level"
- Procedure: "CO Smokerlyzer"